Clinical trial inclusion criterion:
Patients with endometrial or epithelial ovarian cancer who following routine clinical guidelines are offered weekly taxane (paclitaxel) treatment. This will often be a third or fourth line treatment, i.e. patients with advanced disease.

Entity relations:
- Subsumes("taxane", "paclitaxel")
- Has_multiplier("taxane", "weekly")
- AND("treatment", "taxane")
- OR("endometrial ovarian cancer", "epithelial ovarian cancer")